Clinical trial exclusion criterion:
Antiemetics or steroids use within 24 hrs prior to surgery

Entity relations:
- multi("surgery", "surgery")
- Has_index("within 24 hrs prior to surgery", "surgery")
- Has_temporal("Antiemetics", "within 24 hrs prior to surgery")
- OR("Antiemetics", "steroids use")